Clinical trial inclusion criterion:
Veteran receiving care within the Veterans Health Administration healthcare system

Annotated entities:
- Person: "Veteran"
- Visit: "Veterans Health Administration healthcare system"